Clinical trial inclusion criteria:
Estimated glomerular filtration rate =20 mL/min and <60 mL/min
Hgb =8.5 g/dL and =11.5 g/dL
Serum ferritin =500 ng/mL and transferrin saturation (TSAT) =25%
Serum intact parathyroid hormone =600 pg/mL

Annotated entities:
- Measurement: "Estimated glomerular filtration rate"
- Value: "=20 mL/min and <60 mL/min"
- Measurement: "Hgb"
- Value: "=8.5 g/dL and =11.5 g/dL"
- Measurement: "Serum ferritin"
- Value: "=500 ng/mL"
- Measurement: "transferrin saturation"
- Measurement: "TSAT"
- Value: "=25%"
- Measurement: "Serum intact parathyroid hormone"
- Value: "=600 pg/mL"